Clinical trial inclusion criterion:
HbA1c < 8.5%

Annotated entities:
- Measurement: "HbA1c"
- Value: "< 8.5%"